因應血中葡萄糖濃度上升於第二階段（phase II）中緩慢釋出胰島素之細胞內關鍵分子為下列何者？
A. 鈣離子（calcium ion）
B. 麩胺酸鹽（glutamate）
C. 丙酮酸鹽（pyruvate）
D. 鎂離子（magnesium ion）

正確答案：B. 麩胺酸鹽（glutamate）